Male or female patients 2 to 16 years of age

The above is a clinical trial inclusion criterion. Annotated with entity spans:
[Person: Male] or [Person: female] patients [Value: 2 to 16 years] of [Person: age]